Clinical trial exclusion criterion:
Psoriasis or psoriasis arthropathy

Entity relations:
- OR("Psoriasis", "psoriasis arthropathy")